Female patient who is = 18yrs, and = 65yrs.

The above is a clinical trial inclusion criterion. Annotated with entity spans:
[Person: Female] patient who is [Value: = 18yrs], and [Value: = 65yrs].